Pueden presentarse en forma multimérica asociadas con la cadena J las:
1. IgA y la IgG.
2. IgD y la IgM,
3. IdE y la IgD.
4. IgA y la IgD.
5. IgA y la IgM.

Respuesta correcta: 5. IgA y la IgM.